一位 6 歲孩童過馬路時不慎遭到休旅車以 30 公里/小時速度撞上，下列敘述何者正確？
A. 連枷胸（flail chest）發生可能性很高
B. 心肌挫傷的症狀通常會發生
C. 肋骨骨折好發於這個年齡層的孩童
D. 沒有發生肋骨骨折並不能排除肺部挫傷的機會

正確答案：D. 沒有發生肋骨骨折並不能排除肺部挫傷的機會